Able to give consent

The above is a clinical trial inclusion criterion. Annotated with entity spans:
[Non-query-able: Able to give consent]